How does thyroid hormone affect insulin resistance in the heart?

T3 potentiates  insulin signaling and improves  insulin sensitivity. In addition,  T3 lowers  blood glucose in a model of type 2 diabetes. TRalpha P398H mutation is associated with insulin resistance. Circulating T(1)AM is produced from thyroid hormones and is found to be increased in diabetic patients.